Self reported renal disease (severe impaired renal function)

The above is a clinical trial exclusion criterion. Annotated with entity spans:
[Qualifier: Self reported] [Condition: renal disease] ([Qualifier: severe] [Condition: impaired renal function])